下列有關腹腔的敘述，何者錯誤？
A. 男性的腹腔（peritoneal cavity）是完全封閉的
B. 女性的腹腔（peritoneal cavity）是完全封閉的
C. 胰臟是腹膜後器官（retroperitoneal organ）
D. 腹腔小囊（lesser sac）位在胃的後方

正確答案：B. 女性的腹腔（peritoneal cavity）是完全封閉的